Clinical trial exclusion criterion:
Individuals with a history of malignancy are ineligible except for the following circumstances. Individuals with a history of malignancy are eligible if they have been disease-free for at least 5 years and are deemed by the investigator to be at low risk for recurrence of that malignancy. Individuals with the following cancer are eligible if diagnosed and adequately treated within the past 5 years: cervical or breast cancer in situ, and basal cell or squamous cell carcinoma of the skin

Annotated entities:
- Condition: "malignancy"
- Temporal: "history"
- Condition: "disease-free"
- Temporal: "for at least 5 years"
- Mood: "low risk"
- Condition: "recurrence of that malignancy"
- Condition: "that malignancy"
- Subjective_judgement: "deemed by the investigator"
- Condition: "breast cancer in situ"
- Condition: "cervical cancer in situ"
- Temporal: "within the past 5 years"
- Condition: "squamous cell carcinoma of the skin"
- Condition: "basal cell carcinoma of the skin"
- Grammar_Error: "are eligible"
- Negation: "are eligible"
- Mood: "diagnosed"
- Mood: "adequately treated"
- Procedure: "treated"
- Qualifier: "adequately"